一位40歲女性，因車禍接受頭部電腦斷層攝影檢查，發現腦下垂體部位有空蝶鞍（empty sella）現象。她目前月經正常，飯前血糖90 mg/dL，PR 80/min，BP 130/80 mmHg，free T4 1.2 ng/dL（normal range 0.8～ 8 ng/dL)， TSH 1.0μIU/mL（normal range 0.1～2.0 μIU/mL），early morning cortisol 15 μg/dL（normal range 8～18 μg/dL）。下列處置何者最恰當？
A. 經蝶鞍腦下垂體手術（transsphenoid surgery）
B. 放射治療（radiation therapy）
C. 藥物（bromocriptine therapy）
D. 說明病情使病患放心（reassurance）

正確答案：D. 說明病情使病患放心（reassurance）